一位 12 歲男孩在運動時突然倒地昏迷、四肢抽搐、牙關緊咬及兩眼上吊。立即送到急診，此時已持續昏迷及全身僵直性抽搐四十分鐘。以下何種立即處置為錯誤？
A. 給予點滴注射並立即送去作腦部電腦斷層掃描
B. 立即給予點滴注射各種必要之抗癲癇藥物並持續觀察至抽搐停止
C. 立即確立血壓、呼吸及心跳之生理徵象的穩定
D. 有必要立即進行氣管插管及使用呼吸器

正確答案：A. 給予點滴注射並立即送去作腦部電腦斷層掃描